Clinical trial exclusion criterion:
the presence of concurrent infection or inflammation

Entity relations:
- Has_temporal("infection", "concurrent")
- OR("infection", "inflammation")